Clinical trial inclusion criterion:
Formal H.pylori treatment more than two times

Annotated entities:
- Procedure: "H.pylori treatment"
- Multiplier: "more than two times"